下列何者不是類風濕性關節炎（rheumatoid arthritis）的好發部位？
A. 腕關節
B. 肩關節
C. 腰椎關節
D. 踝關節

正確答案：C. 腰椎關節